Clinical trial inclusion criterion:
Born, raised and currently living at low altitude (<800m).

Annotated entities:
- Observation: "living at low altitude"
- Value: "<800m"